Clinical trial inclusion criterion:
45y or older

Entity relations:
- Has_value("y", "45 or older")